下列有關 Streptococcus pyogenes 的敘述，那一項錯誤？
A. Group-specific carbohydrate 又稱 Lancefield group 抗原是用來區分毒性及非毒性 Group A Streptococcus 的分類標準
B. M protein 是用來區分不同種類 Group A Streptococcus 的抗原之一
C. M-like surface proteins 因菌種不同而表現也不一致
D. 並非每一支不同亞型的 Group A Streptococcus 都會產生莢膜（capsule）

正確答案：A. Group-specific carbohydrate 又稱 Lancefield group 抗原是用來區分毒性及非毒性 Group A Streptococcus 的分類標準